Clinical trial exclusion criterion:
Cervical and vaginal infection.

Entity relations:
- OR("Cervical infection", "vaginal infection")